Clinical trial inclusion criterion:
Measurable or non-measurable disease by Response Evaluation Criteria in Solid Tumor (RECIST) 1.1 will be allowed

Annotated entities:
- Measurement: "Response Evaluation Criteria in Solid Tumor"
- Measurement: "RECIST"
- Value: "1.1"